Clinical trial exclusion criterion:
7. Ankle brachial pressure index <0.65

Entity relations:
- Has_value("Ankle brachial pressure index", "<0.65")